Clinical trial exclusion criterion:
Patient or next of kin does not consent with study participation

Annotated entities:
- Informed_consent: "Patient or next of kin does not consent with study participation"